Clinical trial inclusion criterion:
Transient relief of symptoms after diagnostic intra-articular injection into the glenohumeral joint

Entity relations:
- Has_qualifier("intra-articular injection", "glenohumeral joint")
- Has_qualifier("relief of symptoms", "Transient")
- AND("relief of symptoms", "intra-articular injection")